Clinical trial exclusion criterion:
A cardiovascular event in the past month

Entity relations:
- Has_temporal("cardiovascular event", "in the past month")